Body weight > 140 kg

The above is a clinical trial exclusion criterion. Annotated with entity spans:
[Measurement: Body weight] [Value: > 140 kg]